Clinical trial exclusion criterion:
Subject has an active infection either systemic or local.

Entity relations:
- Has_qualifier("infection", "systemic")
- Has_qualifier("infection", "active")
- OR("systemic", "local")